有關 Bruton agammaglobulinemia 的特徵，下列何者錯誤？
A. 血液中缺乏成熟 B 細胞（mature B cells）
B. 血液中總免疫球蛋白（total immunoglobulin）經常小於 100mg/dL
C. 容易有反覆性細菌性肺炎、中耳炎
D. 反覆性感染經常在出生之後 6 個月內發生

正確答案：D. 反覆性感染經常在出生之後 6 個月內發生